妊娠滋養層細胞腫瘤（Gestational trophoblastic tumor）發生轉移（metastasis）時，最常見的轉移部位是：
A. 陰道
B. 骨盆腔
C. 肝
D. 肺

正確答案：D. 肺